Clinical trial exclusion criterion:
Placenda previa and/or accreta

Entity relations:
- OR("Placenda previa", "accreta")